No Beta-Blockers

The above is a clinical trial exclusion criterion. Annotated with entity spans:
[Negation: No] [Drug: Beta-Blockers]